Clinical trial exclusion criterion:
Bare-metal stent implantation within 1 month prior to TAVI procedure;

Annotated entities:
- Device: "Bare-metal stent"
- Procedure: "implantation"
- Temporal: "within 1 month prior to TAVI procedure"
- Procedure: "TAVI procedure"
- Reference_point: "TAVI procedure"